Son esenciales para la coagulación sanguínea:
1. Glóbulos rojos.
2. Glóbulos blancos.
3. Plaquetas.
4. La linfa.
5. La glucosa sérica.

Respuesta correcta: 3. Plaquetas.